4. Can maintain oral food intake during the study

The above is a clinical trial inclusion criterion. Annotated with entity spans:
4. [Non-query-able: Can maintain oral food intake during the study]